Clinical trial exclusion criterion:
endocrine diseases: male hypogonadism, hyperthyroidism, adrenal diseases, pituitary diseases

Annotated entities:
- Condition: "endocrine diseases"
- Condition: "male hypogonadism"
- Condition: "hyperthyroidism"
- Condition: "adrenal diseases"
- Condition: "pituitary diseases"